Clinical trial exclusion criterion:
Suspected cervical vertebral column injury necessitating using a neck collar.

Entity relations:
- Has_mood("cervical vertebral column injury", "Suspected")